Clinical trial exclusion criterion:
Person who weighs more than 136kg.

Annotated entities:
- Person: "weighs"
- Value: "more than 136kg"